For subjects enrolled at Russian sites: Acute disease of any severity on the day of vaccination or febrile illness (axillary temperature ≥ 37.0°C).

The above is a clinical trial exclusion criterion. Annotated with entity spans:
For subjects enrolled at [Visit: Russian sites]: [Condition: Acute disease] of any severity [Temporal: on the day of vaccination] or [Condition: febrile illness] ([Measurement: axillary temperature] [Value: ≥ 37.0°C]).